Clinical trial exclusion criteria:
Exclusions Related to Cardiovascular Disease
1. History of uncontrolled hypertension
2. Persistent hypotension at Screening.
3. Evidence or history of left-sided heart disease and/or clinically significant cardiac disease in which pulmonary hypertension is more likely WHO Group 2.
4. Acute decompensated heart failure within 1 month of Screening.
5. Recent initiation (<8 weeks from Screening) or planned initiation of cardiopulmonary rehabilitation exercise program.
Exclusions Related to Pulmonary Disease
6. Newly diagnosed with PAH and not on PAH-specific therapy.
7. Pulmonary hypertension due to:
1. Uncorrected congenital systemic-to-pulmonary shunt.
2. Pulmonary veno-occlusive disease and/or pulmonary capillary hemangiomatosis
3. Persistent pulmonary hypertension of the newborn
4. WHO clinical classification Groups 2-5
8. Evidence of significant airway and/or parenchymal lung disease.
9. Chronic infection related to tuberculosis or fungal or mycobacterial disease.
Exclusions Based on Other Medical Conditions
10. Chronic infections including, but not limited to tuberculosis (TB), hepatitis B virus (HBV) or hepatitis C virus (HCV).
11. History of portal hypertension or chronic liver disease, including positive serology for infection with HCV and/or HBV.
12. Evidence of active infection requiring intravenous or oral antibiotics within 4 weeks of Screening.
13. Body mass index ≥35.0 at Screening.
14. History of obstructive sleep apnea.
15. History of malignancy within the last 5 years, except nonmelanoma skin cancer and cervical carcinoma in situ treated with curative intent.
16. Neuropsychiatric disorders/symptoms or psychological conditions.
17. Pregnancy or breast-feeding
18. Prior treatment with B cell or lymphocyte-depleting agents (eg, rituximab, Campath)
Exclusions Based on Concomitant Medication Use
19. Concurrent regular use of another leukotriene pathway inhibitor, including over-the-counter medications or herbal remedies.
Exclusions Based on Laboratory Values
20. Significant/chronic renal insufficiency.
21. Transaminases (alanine transaminase, aspartate transaminase) levels >3 × upper limit of normal (ULN) and/or bilirubin level >2 × ULN.
22. Absolute neutrophil count <1500 mm3.
23. Hemoglobin concentration <9 g/dL at Screening.
24. Hepatic dysfunction as defined by Child-Pugh Class B or C

Annotated entities:
- Parsing_Error: "Exclusions Related to Cardiovascular Disease"
- Parsing_Error: "1."
- Condition: "hypertension"
- Qualifier: "uncontrolled"
- Temporal: "History"
- Parsing_Error: "2."
- Condition: "Persistent hypotension"
- Temporal: "at Screening"
- Reference_point: "Screening"
- Parsing_Error: "3."
- Temporal: "history"
- Condition: "left-sided heart disease"
- Condition: "cardiac disease"
- Qualifier: "clinically significant"
- Undefined_semantics: "clinically significant"
- Subjective_judgement: "clinically significant"
- Condition: "pulmonary hypertension"
- Measurement: "WHO Group"
- Value: "2"
- Parsing_Error: "4."
- Condition: "heart failure"
- Qualifier: "decompensated"
- Qualifier: "Acute"
- Temporal: "within 1 month of Screening"
- Reference_point: "Screening"
- Parsing_Error: "5."
- Temporal: "<8 weeks from Screening"
- Temporal: "Recent"
- Reference_point: "Screening"
- Qualifier: "planned"
- Non-query-able: "planned"
- Procedure: "cardiopulmonary rehabilitation exercise program"
- Parsing_Error: "Exclusions Related to Pulmonary Disease"
- Parsing_Error: "6."
- Condition: "PAH"
- Procedure: "PAH-specific therapy"
- Negation: "not"
- Temporal: "Newly diagnosed"
- Parsing_Error: "7."
- Parsing_Error: "Pulmonary hypertension due to:"
- Parsing_Error: "1."
- Condition: "congenital systemic-to-pulmonary shunt"
- Qualifier: "Uncorrected"
- Parsing_Error: "2."
- Condition: "Pulmonary veno-occlusive disease"
- Undefined_semantics: "Pulmonary veno-occlusive disease"
- Condition: "pulmonary capillary hemangiomatosis"
- Parsing_Error: "3."
- Condition: "pulmonary hypertension of the newborn"
- Qualifier: "Persistent"
- Parsing_Error: "4."
- Measurement: "WHO clinical classification"
- Value: "Groups 2-5"
- Parsing_Error: "8."
- Condition: "airway disease"
- Condition: "parenchymal lung disease"
- Qualifier: "significant"
- Subjective_judgement: "significant"
- Undefined_semantics: "significant"
- Parsing_Error: "9."
- Condition: "tuberculosis"
- Condition: "fungal disease"
- Condition: "mycobacterial disease"
- Multiplier: "Chronic"
- Condition: "infection"
- Observation: "related to"
- Parsing_Error: "Exclusions Based on Other Medical Conditions"
- Parsing_Error: "10."
- Condition: "tuberculosis (TB)"
- Condition: "hepatitis B virus (HBV)"
- Condition: "hepatitis C virus (HCV)"
- Condition: "infections"
- Multiplier: "Chronic"
- Parsing_Error: "11."
- Condition: "portal hypertension"
- Condition: "chronic liver disease"
- Measurement: "serology for infection with HCV"
- Measurement: "serology for infection HBV"
- Value: "positive"
- Parsing_Error: "12."
- Condition: "infection requiring antibiotics"
- Undefined_semantics: "infection requiring antibiotics"
- Subjective_judgement: "infection requiring antibiotics"
- Temporal: "within 4 weeks of Screening"
- Reference_point: "Screening"
- Parsing_Error: "13."
- Measurement: "Body mass index"
- Value: "≥35.0"
- Temporal: "at Screening"
- Reference_point: "Screening"
- Parsing_Error: "14."
- Condition: "obstructive sleep apnea"
- Temporal: "History"
- Parsing_Error: "15."
- Condition: "malignancy"
- Undefined_semantics: "malignancy"
- Temporal: "within the last 5 years"
- Temporal: "History"
- Condition: "nonmelanoma skin cancer"
- Negation: "except"
- Condition: "cervical carcinoma in situ"
- Procedure: "treated"
- Qualifier: "curative intent"
- Parsing_Error: "16."
- Condition: "Neuropsychiatric disorders"
- Undefined_semantics: "Neuropsychiatric disorders"
- Condition: "psychological conditions"
- Condition: "Neuropsychiatric symptoms"
- Undefined_semantics: "Neuropsychiatric symptoms"
- Undefined_semantics: "psychological conditions"
- Parsing_Error: "17."
- Condition: "Pregnancy"
- Condition: "breast-feeding"
- Parsing_Error: "18."
- Drug: "B cell -depleting agents"
- Drug: "lymphocyte-depleting agents"
- Drug: "rituximab"
- Drug: "Campath"
- Temporal: "Prior"
- Parsing_Error: "Exclusions Based on Concomitant Medication Use"
- Parsing_Error: "19."
- Drug: "leukotriene pathway inhibitor"
- Qualifier: "another"
- Context_Error: "another"
- Multiplier: "regular use"
- Undefined_semantics: "over-the-counter medications or herbal remedies"
- Temporal: "Concurrent"
- Parsing_Error: "Exclusions Based on Laboratory Values"
- Parsing_Error: "20."
- Condition: "chronic renal insufficiency"
- Qualifier: "Significant"
- Subjective_judgement: "Significant"
- Parsing_Error: "21."
- Measurement: "alanine transaminase"
- Measurement: "aspartate transaminase"
- Value: ">3 × upper limit of normal (ULN)"
- Measurement: "Transaminases levels"
- Measurement: "bilirubin level"
- Value: ">2 × ULN"
- Parsing_Error: "22."
- Measurement: "Absolute neutrophil count"
- Value: "<1500 mm3"
- Parsing_Error: "23."
- Measurement: "Hemoglobin concentration"
- Value: "<9 g/dL"
- Temporal: "at Screening"
- Reference_point: "Screening"
- Parsing_Error: "24."
- Condition: "Hepatic dysfunction"
- Measurement: "Child-Pugh"
- Value: "Class B or C"